Clinical trial exclusion criterion:
Best-corrected visual acuity < 20/200 (Snellen equivalent);

Annotated entities:
- Measurement: "Best-corrected visual acuity"
- Value: "< 20/200"